Según Maslow (1967) para que el ser humano se realice plenamente debe:
1. Satisfacer sus metanecesidades (necesidades B), una vez satisfechas sus necesidades básicas.
2. Satisfacer sus necesidades básicas (necesidades D).
3. Ser productivo y maduro.
4. Integrar sus impulsos más básicos en formas de acción culturalmente viables.

Respuesta correcta: 1. Satisfacer sus metanecesidades (necesidades B), una vez satisfechas sus necesidades básicas.